Clinical trial inclusion criteria:
age 35-75 years;
Diagnosis of Type 2 Diabetes from at least 3 years;
HbA1c < 10%;
normal blood pressure or controlled hypertension;
BMI < 40;

Annotated entities:
- Person: "age"
- Value: "35-75 years"
- Condition: "Type 2 Diabetes"
- Temporal: "at least 3 years"
- Measurement: "HbA1c"
- Value: "< 10%"
- Condition: "normal blood pressure"
- Condition: "controlled hypertension"
- Measurement: "BMI"
- Value: "< 40"